Clinical trial inclusion criterion:
Diagnosis of schizophrenia or schizoaffective disorder

Annotated entities:
- Condition: "schizophrenia"
- Condition: "schizoaffective disorder"